Clinical trial exclusion criteria:
Nursing homes will not be eligible to participate if they meet the following criteria:
Facilities routinely using decolonization
Dedicated psychiatric nursing homes
Facilities with a resident population with >=20% combative patients
Pediatric facilities

Annotated entities:
- Visit: "Nursing homes"
- Non-representable: "if they meet the following criteria:"
- Multiplier: "routinely"
- Procedure: "decolonization"
- Visit: "psychiatric nursing homes"
- Measurement: "resident population"
- Value: ">=20%"
- Observation: "combative patients"
- Visit: "Pediatric facilities"